Clinical trial exclusion criterion:
Popliteal artery stenosis >50% at P2 or P3 segment

Entity relations:
- Has_value("Popliteal artery stenosis", ">50%")
- Has_qualifier("Popliteal artery stenosis", "P2 or P3 segment")